Which diseases that can be treated using the focused ultrasound thalamotomy.

Focused ultrasound thalamotomy is used for treatment of Parkinson disease, essential tremor, obsessive-compulsive disorder and chronic neuropathic pain.